Clinical trial inclusion criterion:
Able and willing to comply with all pre-, post-, and follow-up testing and requirements

Annotated entities:
- Non-query-able: "Able and willing to comply with all pre-, post-, and follow-up testing and requirements"